Clinical trial inclusion criterion:
Clinically stable for at least 1 month prior to entry into the study

Entity relations:
- Has_temporal("stable", "for at least 1 month prior to entry into the study")
- Has_index("for at least 1 month prior to entry into the study", "entry into the study")